疾病篩檢以系列檢定（Sequential Testing）為之，對篩檢效度有何影響？
A. 淨敏感度（Net sensitivity）增加
B. 淨特異度（Net specificity）增加
C. 淨特異度（Net specificity）減少
D. 偽陽性率（False positive rate）增加

正確答案：B. 淨特異度（Net specificity）增加